Clinical trial inclusion criterion:
Age: ≥ 18 years

Annotated entities:
- Person: "Age"
- Value: "≥ 18 years"